下列那一種抗真菌（anti-fungal）藥物的抗藥機制，是在合成葡聚醣（glucan）的相關基因上產生突變？
A. 氟胞嘧啶（Flucytosine）
B. 棘白素類（Echinocandins）
C. 丙烯胺類（Allylamines）
D. 兩性黴素B（Amphotericin B）

正確答案：B. 棘白素類（Echinocandins）